Patients with previous lumbar surgery.

The above is a clinical trial exclusion criterion. Annotated with entity spans:
Patients with previous [Procedure: lumbar surgery.]